下列何者最不會造成腦性麻痺？
A. 胎兒心跳過快（fetal tachycardia）
B. 新生兒癲癇發作（neonatal seizure）
C. 出生體重小於2,500公克
D. 母親智能障礙

正確答案：A. 胎兒心跳過快（fetal tachycardia）